Clinical trial exclusion criterion:
Any contraindication to allergy testing will also result in exclusion

Annotated entities:
- Condition: "contraindication"
- Procedure: "allergy testing"